Surgical Closure of abdominal wall defect with prosthetic material (e.g. prosthetic or bio-prosthetic mesh)

The above is a clinical trial exclusion criterion. Annotated with entity spans:
[Procedure: Surgical Closure] of [Condition: abdominal wall defect] with [Device: prosthetic material] (e.g. [Device: prosthetic] or [Device: bio-prosthetic mesh])